Clinical trial inclusion criteria:
female or male of 50 to 85 years old with a care giver
Mini Mental Status (MMS) test between 16 to 26 inclusive
Clinical Dementia Rating (CDR) test inferior or equal to 1
National Institute of Neurological and Communicative Disorders and Stroke / Alzheimer's Disease and Related Disorders Association (NINCDS/ADRDA) test positive for an Alzheimer's disease
Diagnostic and Statistical Manual of Mental Disorders, 4th Edition (DSM IV) test positive for dementia

Annotated entities:
- Value: "50 to 85 years"
- Person: "old"
- Measurement: "Mini Mental Status (MMS) tes"
- Value: "between 16 to 26 inclusive"
- Measurement: "Clinical Dementia Rating (CDR) test"
- Value: "inferior or equal to 1"
- Measurement: "National Institute of Neurological and Communicative Disorders and Stroke / Alzheimer's Disease and Related Disorders Association (NINCDS/ADRDA) test"
- Value: "positive"
- Measurement: "Diagnostic and Statistical Manual of Mental Disorders, 4th Edition (DSM IV) test"
- Value: "positive"